Clinical trial inclusion criteria:
Age greater than 18
Planned thoracoscopy with low probability(by surgeon estimate) of conversion to open procedure

Annotated entities:
- Person: "Age"
- Value: "greater than 18"
- Procedure: "thoracoscopy"
- Subjective_judgement: "low probability(by surgeon estimate) of conversion to open procedure"
- Undefined_semantics: "low probability(by surgeon estimate) of conversion to open procedure"
- Non-query-able: "Planned thoracoscopy with low probability(by surgeon estimate) of conversion to open procedure"
- Qualifier: "low probability(by surgeon estimate) of conversion to open procedure"